Clinical trial exclusion criterion:
Systemic diseases (diabetes, renal diseases, rheumatic diseases, osteoporosis and cardiovascular diseases)

Annotated entities:
- Condition: "Systemic diseases"